Clinical trial exclusion criterion:
7. Known allergy to rice, rice bran, or related food products.

Entity relations:
- AND("allergy to rice", "rice")
- AND("allergy to rice bran", "rice bran")